List BET proteins.

BRD2
BRD3
BRD4
Bdf1